Clinical trial exclusion criterion:
2. Persistent hypotension at Screening.

Entity relations:
- Has_index("at Screening", "Screening")
- Has_temporal("Persistent hypotension", "at Screening")